Clinical trial inclusion criterion:
Able to provide voluntary, written informed consent with comprehension of all aspects of the protocol, prior to any study procedures.

Annotated entities:
- Post-eligibility: "Able to provide voluntary, written informed consent with comprehension of all aspects of the protocol, prior to any study procedures."
- Non-query-able: "Able to provide voluntary, written informed consent with comprehension of all aspects of the protocol, prior to any study procedures."